Clinical trial exclusion criterion:
8. Known allergy to mushrooms or related food products.

Annotated entities:
- Condition: "allergy to mushrooms"
- Condition: "allergy to food products"